Clinical trial exclusion criterion:
Regular smoker (> 5 cigarettes, > 1 pipeful or > 1 cigar per day)

Entity relations:
- Has_multiplier("pipeful", "> 1")
- Has_multiplier("cigarettes", "> 5")
- Has_multiplier("cigar", "> 1 per day")
- Subsumes("Regular smoker", "cigarettes")
- OR("cigarettes", "pipeful", "cigar")